有效風險溝通之團隊組成，建議由四種專家為基礎共同組成，包括：
A. 主題事件專家、投資報酬分析專家、實地溝通專業人員和風險及決策分析專家
B. 主題事件專家、行為科學專家、實地溝通專業人員和臨床心理學專家
C. 主題事件專家、投資報酬分析專家、技術專業人員和風險及決策分析專家
D. 主題事件專家、行為科學專家、實地溝通專業人員和風險及決策分析專家

正確答案：D. 主題事件專家、行為科學專家、實地溝通專業人員和風險及決策分析專家